Clinical trial exclusion criterion:
9. Baseline creatinine >20% above the upper limit of normal for age

Annotated entities:
- Measurement: "creatinine"
- Temporal: "Baseline"
- Value: ">20% above the upper limit of normal for age"
- Person: "age"